The Mantoux test detects what latent infection/disease?

The Mantoux tuberculin skin test tests for latent tuberculosis